關於伍氏燈（Wood's lamp）的臨床使用，下列何者錯誤？
A. 光源為紫外光，波長範圍屬於UVA
B. 表皮色素病灶如雀斑，照射伍氏燈呈色會變淡
C. 伍氏燈觀察下，真皮層色素病灶較不會有反差變化
D. 伍氏燈觀察下，黑色素細胞缺乏的病灶，反差會加大

正確答案：B. 表皮色素病灶如雀斑，照射伍氏燈呈色會變淡